Clinical trial inclusion criterion:
Fulfills NIH criteria for bariatric surgery

Annotated entities:
- Measurement: "NIH criteria"
- Condition: "bariatric surgery"
- Value: "Fulfills"